人類的粗皮病（pellagra）是由於缺乏下列那種維生素所引起？
A. 生物素（biotin）
B. 泛酸（pantothenic acid）
C. 葉酸（folic acid）
D. 菸鹼酸（niacin）

正確答案：D. 菸鹼酸（niacin）